某研究者想探討酒駕與死亡車禍的關係，所以在某縣市統計半年的車禍資料，將車禍分為是否有人員24小時內死亡，並調查每次車禍中開車者是否有酒駕行為，下列統計分析方法何者最恰當？
A. 線性迴歸（Linear regression）
B. 獨立樣本t檢定（Independent sample t-test）
C. 配對t檢定（Paired t-test）
D. 卡方檢定（Chi-square test）

正確答案：D. 卡方檢定（Chi-square test）